Refusal of treatment or contraindication to NeuroAiD

The above is a clinical trial exclusion criterion. Annotated with entity spans:
Refusal of treatment or [Condition: contraindication] to [Procedure: NeuroAiD]